Intracranial or cerebral haemorrhage

The above is a clinical trial inclusion criterion. Annotated with entity spans:
[Condition: Intracranial] or [Condition: cerebral haemorrhage]